Clinical trial inclusion criterion:
5. ECOG performance status of 0 or 1.

Annotated entities:
- Parsing_Error: "5."
- Measurement: "ECOG performance status"
- Value: "0 or 1"